Clinical trial exclusion criterion:
Significant arterial disease (Ankle Brachial Pressure Index <0•9 or evidence on Arterial Duplex)

Annotated entities:
- Condition: "arterial disease"
- Qualifier: "Significant"
- Measurement: "Ankle Brachial Pressure Index"
- Value: "<0•9"
- Procedure: "Arterial Duplex"